Clinical trial exclusion criterion:
underlying lung or heart disase

Annotated entities:
- Condition: "heart disase"
- Condition: "lung disase"